下列何者是B-型 DNA雙螺旋的最適詮釋？
A. 右旋；每一鹼基對之間的間距為3.6 Å
B. 右旋；每一鹼基對之間的間距為3.4 Å
C. 左旋；每一鹼基對之間的間距為3.4 Å
D. 左旋；每一鹼基對之間的間距為3.6 Å

正確答案：B. 右旋；每一鹼基對之間的間距為3.4 Å